Clinical trial inclusion criterion:
Able and willing to personally comply with and execute all aspects of the study requirements for the caregivers or guardians

Entity relations:
- AND("willing to personally comply", "caregivers")
- AND("willing to personally comply", "Able to personally comply")
- OR("caregivers", "guardians")